Clinical trial inclusion criterion:
ASA (American Society of Anesthesiologists) class 1 & 2,

Entity relations:
- Has_value("ASA", "class 1 & 2")